Atrioventricular block II and III in patients without pacemaker

The above is a clinical trial exclusion criterion. Annotated with entity spans:
[Condition: Atrioventricular block II] and III in patients [Negation: without] [Device: pacemaker]